Entre las diferencias en el tratamiento de los trastornos afectivos entre la terapia cognitiva de Beck y la terapia interpersonal, ¿cuál de las siguientes es CORRECTA?
1. La terapia interpersonal ha sido aplicada al tratamiento del trastorno bipolar, pero la terapia cognitiva de Beck todavía no.
2. La terapia cognitiva de Beck es una terapia estructurada con un número breve de sesiones, mientras que la terapia interpersonal no.
3. La terapia cognitiva de Beck fue creada por un psiquiatra, mientras que la terapia interpersonal fue creada por un psicólogo.
4. La terapia interpersonal está basada en la noción de vínculo afectivo de la psicología evolutiva, mientras que la terapia cognitiva de Beck no.
5. La terapia cognitiva de Beck es uno de los tratamientos psicológicos que tienen bien establecida su eficacia en el trastorno depresivos mayor en adultos, mientras que la terapia interpersonal todavía no.

Respuesta correcta: 4. La terapia interpersonal está basada en la noción de vínculo afectivo de la psicología evolutiva, mientras que la terapia cognitiva de Beck no.